Heavily calcified or angulated lesion

The above is a clinical trial exclusion criterion. Annotated with entity spans:
[Qualifier: Heavily calcified] or [Qualifier: angulated] [Condition: lesion]